一位76歲獨居老人有心律不整之病史，平常服用毛地黃（Digoxin）控制。本次因頭暈、噁心和胸悶，被鄰居發現並且帶來急診室。經病史詢問後，病人表示因為心情不好就將半個月份的毛地黃都吃下去，到院時意識清楚，體溫正常、呼吸22次/min、心跳42次/min、血壓96/60mmHg，下列何項處置最不恰當？
A. 抽血檢測毛地黃濃度（digoxin level）
B. 給予硝化甘油（nitroglycerin）
C. 給予經皮心臟節律器（transcutaneous pacemaker, TCP）
D. 靜脈注射atropine 0.5mg

正確答案：B. 給予硝化甘油（nitroglycerin）